Clinical trial inclusion criteria:
Moderate to advanced generalized chronic periodontitis
Body mass index: > 18.5 kg/m2
Minimum of 12 natural teeth
Smokers, non-smokers or former-smokers

Annotated entities:
- Qualifier: "Moderate to advanced"
- Condition: "generalized chronic periodontitis"
- Measurement: "Body mass index"
- Value: "> 18.5 kg/m2"
- Multiplier: "Minimum of 12"
- Observation: "natural teeth"
- Condition: "Smokers"
- Condition: "non-smokers"
- Condition: "former-smokers"